臨床上使用G-CSF治療多發性骨髓瘤（multiple myeloma）過程中，可併服造血性幹細胞穩定藥物plerixafor，以達較佳療效。試問此穩定藥物之作用機制為何？
A. 強化JAK/STAT訊息活化
B. 促進G-CSF釋出
C. 抑制CXC chemokine receptor 4（CXCR4）
D. 提高G-CSF與接受體之結合效益

正確答案：C. 抑制CXC chemokine receptor 4（CXCR4）